Clinical trial exclusion criterion:
Chronic Kidney Disease (glomerular filtration rate <45 Milliliter per minute).

Entity relations:
- Has_value("glomerular filtration rate", "<45 Milliliter per minute")
- AND("Chronic Kidney Disease", "glomerular filtration rate")